Informed consent received

The above is a clinical trial inclusion criterion. Annotated with entity spans:
[Informed_consent: Informed consent received]